對於疑似	血症伴有低血壓的成人急救流程（protocol for resuscitation of adult hypotensive patients with suspected sepsis），下列何者不適當？
A. 做體液培養，包括血液
B. 放中央靜脈或是肺動脈導管，保持CVP/PAWP level＜8 mmHg
C. 復甦的目標定在平均血壓大於65 mmHg或是脈搏小於120 beats/min
D. 監測靜脈氧氣濃度和尿量

正確答案：B. 放中央靜脈或是肺動脈導管，保持CVP/PAWP level＜8 mmHg